一位 40 歲男性病患，每天喝兩至三瓶高粱酒約 20 年。最近 5 年他常有噁心及嘔吐的現象，這次入院主要是於強烈嘔吐後有吐血的現象發生。他被送到急診時體溫 36.8℃、血壓 80/40 mmHg、脈搏 110/min、呼吸 22/min。身體檢查沒有聽到心雜音，兩側呼吸音亦正常，他的腹部沒有脹大亦沒有壓痛。他的心電圖及胸部 X 光均正常，大便檢查也沒有潛血。接下來要做下列那種檢查？
A. 腹部電腦斷層掃描
B. 腹部血管攝影
C. 上消化道內視鏡檢查
D. 腹部超音波檢查

正確答案：C. 上消化道內視鏡檢查